Clinical trial inclusion criterion:
office blood pressure = 150/95 mmHg (confirmed on a second day; 24h ambulatory blood pressure measurement (ABPM) is allowed to check accuracy of office values; inclusion with 24h mean blood pressure = 145/90 mm Hg is possible); patients with hypertension should be treated according to current treatment guidelines

Entity relations:
- Has_value("blood pressure", "= 150/95 mmHg")